List the blood group antigens, associated with blood type

ABO antigens are highly abundant in many human cell types, including platelets, vascular endothelium, and red blood cells.